Clinical trial inclusion criterion:
6. Documented stable angina pectoris [Canadian Cardiovascular Society Classification (CCS) 1, 2, 3, or 4], unstable angina pectoris with documented ischemia (Braunwald Class IB-C, IIB-C, or IIIB-C), non-ST segment elevation myocardial infarction, or documented silent ischemia.

Annotated entities:
- Condition: "stable angina pectoris"
- Measurement: "Canadian Cardiovascular Society Classification (CCS)"
- Value: "1, 2, 3, or 4"
- Qualifier: "stable"
- Qualifier: "unstable"
- Condition: "unstable angina pectoris"
- Condition: "ischemia"
- Observation: "documented"
- Measurement: "Braunwald Class"
- Value: "IB-C, IIB-C, or IIIB-C"
- Condition: "non-ST segment elevation myocardial infarction"
- Condition: "silent ischemia"
- Qualifier: "silent"
- Observation: "documented"